Clinical trial exclusion criterion:
Seizure occurred by metabolic factors (hypoglycemia, hypocalcemia, electrolyte disorder)

Annotated entities:
- Condition: "Seizure"
- Qualifier: "metabolic factors"
- Condition: "hypoglycemia"
- Condition: "hypocalcemia"
- Condition: "electrolyte disorder"